La histidina e histamina son dos compuestos con importancia biológica que presentan en común como unidad estructural:
1. Piridina.
2. Piperidina.
3. Triazina.
4. Fenol.
5. Imidazol.

Respuesta correcta: 5. Imidazol.